一位建築工地工人在工作中由二樓摔到地面，骨盆	地，被緊急送往醫院。病人血壓穩定，心跳快速，下腹疼痛併尿滯留，下列何者錯誤？
A. 病人之尿道開口有血時，必須要排除尿道受傷的可能
B. 骨盆骨折常併有膜部尿道（membranous urethra）受傷
C. 膜部尿道（membranous urethra）受傷後，肛門指診時，前列腺可能會移位
D. 跨騎受傷（straddle injury）時，膜部尿道（membranous urethra）容易受傷

正確答案：D. 跨騎受傷（straddle injury）時，膜部尿道（membranous urethra）容易受傷